Platelet count < 75 at the time of enrollment

The above is a clinical trial exclusion criterion. Annotated with entity spans:
[Measurement: Platelet count] [Value: < 75] at the time of enrollment